Clinical trial exclusion criterion:
Patients with a history of pulmonary embolism, or untreated deep vein thrombosis within the past 6 months

Entity relations:
- Has_qualifier("deep vein thrombosis", "untreated")
- Has_temporal("pulmonary embolism", "history")
- Has_temporal("pulmonary embolism", "within the past 6 months")
- OR("pulmonary embolism", "deep vein thrombosis")